Patients who agree to participate in the study.

The above is a clinical trial inclusion criterion. Annotated with entity spans:
[Informed_consent: Patients who agree to participate in the study.]